Clinical trial exclusion criterion:
Pronounced congenital defects or serious chronic diseases in the acute stage, including any clinically important exacerbation of chronic diseases of the liver, kidney, cardiovascular, nervous system, mental diseases or metabolic disorders, confirmed by the history or objective examination (pulmonary: cystic fibrosis, lung abscess, empyema, active tuberculosis; extra-pulmonary: congestive heart failure, malabsorption, chronic renal and hepatic failure, cirrhosis, malignancy, immunodeficiency, cirrhosis of the liver);

Annotated entities:
- Condition: "congenital defects"
- Condition: "chronic diseases"
- Qualifier: "acute stage"
- Qualifier: "clinically important"
- Qualifier: "serious"
- Condition: "exacerbation"
- Condition: "diseases of the liver"
- Qualifier: "chronic"
- Condition: "diseases of the kidney"
- Condition: "diseases of the cardiovascular system"
- Condition: "diseases of the nervous system"
- Condition: "mental diseases"
- Condition: "metabolic disorders"
- Condition: "cystic fibrosis"
- Condition: "lung abscess"
- Condition: "empyema"
- Qualifier: "active"
- Condition: "tuberculosis"
- Condition: "congestive heart failure"
- Condition: "malabsorption"
- Condition: "hepatic failure"
- Condition: "renal failure"
- Qualifier: "chronic"
- Condition: "cirrhosis"
- Condition: "malignancy"
- Condition: "immunodeficiency"
- Condition: "cirrhosis of the liver"